Clinical trial inclusion criterion:
HBsAg negative/HBcAb positive/hepatitis B virus DNA negative at baseline

Annotated entities:
- Measurement: "HBsAg"
- Value: "negative"
- Measurement: "HBcAb"
- Value: "positive"
- Measurement: "hepatitis B virus DNA"
- Value: "negative"
- Temporal: "at baseline"